Spondylolisthesis Grade II or higher.

The above is a clinical trial exclusion criterion. Annotated with entity spans:
[Condition: Spondylolisthesis] [Measurement: Grade] [Value: II or higher].